Clinical trial exclusion criterion:
Sildenafil (Viagra), tadalafil (Cialis), vardenafil (Levitra), and avanafil (Stendra) will not be permitted during the study drug dose Titration Period, because of increased risk of hypotension in combination with alpha-1 blockers, but will be allowed at half the usual starting dose following the study drug dose Titration Period, per VA prescribing guidelines.

Entity relations:
- Subsumes("Sildenafil", "Viagra")
- Subsumes("tadalafil", "Cialis")
- Subsumes("vardenafil", "Levitra")
- Subsumes("avanafil", "Stendra")
- Has_temporal("Sildenafil", "during the study drug dose Titration Period")
- OR("Sildenafil", "tadalafil", "vardenafil", "avanafil")